一位 10 歲女童，因全身抽搐（Seizure）至急診，體溫 38.5℃，已停止抽搐，意識清楚，過去並無抽搐病史，下列處置何者最不適當？
A. 馬上給予 Phenytoin
B. 建立靜脈注射輸液路徑
C. 若懷疑是腦膜炎（meningitis），應安排做脊髓穿刺（lumbar puncture）
D. 保持呼吸道通暢，給予氧氣

正確答案：A. 馬上給予 Phenytoin